8. Adequate renal function as follows (10% deviation allowed)

The above is a clinical trial inclusion criterion. Annotated with entity spans:
[Parsing_Error: 8.] [Parsing_Error: Adequate renal function as follows (10% deviation allowed)]